What is the Versene Solution used for?

the Versene Solution is used for the detachment of stem cell sheets.